與一般產婦相較，前胎接受剖腹產且此胎嘗試陰道分娩（VBAC, vaginal birth after cesarean section） 的產婦，有較高的機會發生下列何種情形？
A. 子宮破裂
B. 新生兒死亡
C. 母親死亡
D. 血栓形成

正確答案：A. 子宮破裂